Clinical trial exclusion criterion:
Allergies to study drugs.

Annotated entities:
- Condition: "Allergies"
- Drug: "study drugs"